Variants in which genes cause nonsyndromic retinal degeneration?

Variants in DYNC2H1, IFT81, USH2A and ABHD12 can cause nonsyndromic retinal degeneration.